Clinical trial exclusion criteria:
Patients undergoing bilateral hip or knee replacement;
Patients undergoing total hip or knee replacement who have been enrolled in this study for a prior hip or knee replacement;
Patients who are concurrently enrolled in another active interventional clinical trial testing a drug or intervention known or believed to interact with aspirin, warfarin, or rivaroxaban;
Patients who have a contraindication to two or more of the three study prophylaxis regimens;
Women who are pregnant or breastfeeding, as well as those of reproductive potential unless there is a negative urine pregnancy test on the day of surgery;
Patients on chronic (longer than the prior 6 months) anticoagulation other than with antiplatelet medications;
Patients with documented gastrointestinal, cerebral, or other hemorrhage within 3 months of the operation;
Patients with a known diagnosis of defective hemostasis and past history of clinical bleeding requiring transfusion and treatment;
Patients who have had an operative procedure involving the eye, ear, or central nervous system within one month;
Patients with severe uncontrolled hypertension with systolic BP > 220mmHg or diastolic BP > 120mmHg;
Patients with an absolute body weight of less than 41 kilograms (90.4 lbs) at baseline visit;
Vulnerable patient populations including prisoners and institutionalized individuals.

Annotated entities:
- Procedure: "knee replacement"
- Procedure: "hip replacement"
- Qualifier: "bilateral"
- Procedure: "total knee replacement"
- Procedure: "total hip replacement"
- Competing_trial: "atients undergoing total hip or knee replacement who have been enrolled in this study for a prior hip or knee replacement;"
- Competing_trial: "Patients who are concurrently enrolled in another active interventional clinical trial testing a drug or intervention known or believed to interact with aspirin, warfarin, or rivaroxaban"
- Condition: "contraindication"
- Non-representable: "Patients who have a contraindication to two or more of the three study prophylaxis regimens"
- Pregnancy_considerations: "Women who are pregnant or breastfeeding, as well as those of reproductive potential unless there is a negative urine pregnancy test on the day of surgery"
- Drug: "anticoagulation"
- Negation: "other than"
- Drug: "antiplatelet"
- Temporal: "longer than the prior 6 months"
- Condition: "gastrointestinal hemorrhage"
- Condition: "cerebral hemorrhage"
- Condition: "hemorrhage"
- Temporal: "within 3 months of the operation"
- Reference_point: "operation"
- Condition: "hemostasis"
- Qualifier: "defective"
- Condition: "bleeding"
- Procedure: "transfusion"
- Procedure: "treatment"
- Procedure: "operative procedure"
- Qualifier: "eye"
- Qualifier: "ear"
- Qualifier: "central nervous system"
- Temporal: "within one month"
- Condition: "hypertension"
- Qualifier: "uncontrolled"
- Qualifier: "severe"
- Measurement: "systolic BP"
- Value: "> 220mmHg"
- Measurement: "diastolic BP"
- Value: "> 120mmHg"
- Measurement: "body weight"
- Value: "less than 41 kilograms"
- Value: "90.4 lbs"
- Person: "prisoners"
- Visit: "institutionalized"